Medical, geographic or social conditions impairing the participation in the study or inability to understand and sign the informed consent term.

The above is a clinical trial exclusion criterion. Annotated with entity spans:
[Post-eligibility: Medical, geographic or social conditions impairing the participation in the study or inability to understand and sign the informed consent term.]